Clinical trial exclusion criterion:
ocular surgery within the past 3 mouths

Annotated entities:
- Procedure: "ocular surgery"
- Temporal: "within the past 3 mouths"